Clinical trial exclusion criterion:
Disease which affect efficacy and safety of drugs

Entity relations:
- Has_qualifier("Disease", "affect efficacy")
- OR("affect efficacy", "safety of drugs")